Clinical trial exclusion criteria:
Is not a habitual wearer of Avaira sphere lenses
Has a CL prescription outside the range of the available parameters of the study lenses.
Has a spectacle cylinder ≥1.00D of cylinder in either eye.
Has a history of not achieving comfortable CL wear (5 days per week; > 8 hours/day)
Has contact lens best corrected distance vision worse than 20/25 (0.10 logMAR) in either eye.
Presence of clinically significant (grade 2-4) anterior segment abnormalities
Presence of ocular or systemic disease or need of medications which might interfere with contact lens wear.
Slit lamp findings that would contraindicate contact lens wear such as:
Pathological dry eye or associated findings
Pterygium, pinguecula, or corneal scars within the visual axis
Neovascularization > 0.75 mm in from of the limbus
Giant papillary conjunctivitis (GCP) worse than grade 1
Anterior uveitis or iritis (past or present)
Seborrheic eczema, Seborrheic conjunctivitis
History of corneal ulcers or fungal infections
Poor personal hygiene
Has a known history of corneal hypoesthesia (reduced corneal sensitivity)
Has aphakia, keratoconus or a highly irregular cornea.
Has Presbyopia or has dependence on spectacles for near work over the contact lenses.
Has undergone corneal refractive surgery.
Is participating in any other type of eye related clinical or research study

Annotated entities:
- Device: "Avaira sphere lenses"
- Device: "CL prescription"
- Context_Error: "outside the range of the available parameters of the study lenses"
- Non-query-able: "outside the range of the available parameters of the study lenses"
- Qualifier: "outside the range of the available parameters of the study lenses"
- Device: "spectacle cylinder"
- Value: "≥1.00D"
- Temporal: "history"
- Condition: "comfortable CL wear"
- Negation: "not"
- Temporal: "5 days per week"
- Temporal: "> 8 hours/day"
- Measurement: "contact lens best corrected distance vision"
- Value: "worse than 20/25 in either eye"
- Value: "worse than 0.10 logMAR in either eye"
- Qualifier: "clinically significant"
- Subjective_judgement: "clinically significant"
- Qualifier: "grade 2-4"
- Value: "2-4"
- Condition: "anterior segment abnormalities"
- Context_Error: "anterior segment abnormalities"
- Condition: "systemic disease"
- Condition: "ocular disease"
- Condition: "need of medications"
- Undefined_semantics: "need of medications"
- Subjective_judgement: "need of medications"
- Undefined_semantics: "ocular or systemic disease"
- Qualifier: "might interfere with contact lens wear"
- Subjective_judgement: "might interfere with contact lens wear"
- Procedure: "Slit lamp"
- Value: "findings"
- Undefined_semantics: "findings"
- Condition: "contraindicate contact lens"
- Undefined_semantics: "contraindicate contact lens"
- Parsing_Error: "Slit lamp findings that would contraindicate contact lens wear such as:"
- Condition: "Pathological dry eye"
- Condition: "associated findings"
- Condition: "Pterygium"
- Condition: "pinguecula"
- Condition: "corneal scars"
- Qualifier: "within the visual axis"
- Condition: "Neovascularization"
- Value: "> 0.75 mm in from of the limbus"
- Condition: "Giant papillary conjunctivitis (GCP)"
- Qualifier: "worse than grade 1"
- Condition: "Anterior uveitis"
- Condition: "iritis"
- Temporal: "past"
- Temporal: "present"
- Condition: "Seborrheic eczema"
- Condition: "Seborrheic conjunctivitis"
- Condition: "corneal ulcers"
- Condition: "fungal infections"
- Temporal: "History"
- Condition: "Poor personal hygiene"
- Condition: "corneal hypoesthesia"
- Condition: "reduced corneal sensitivity"
- Temporal: "history"
- Condition: "aphakia"
- Condition: "keratoconus"
- Condition: "highly irregular cornea"
- Condition: "Presbyopia"
- Condition: "dependence on spectacles for near work"
- Procedure: "corneal refractive surgery"
- Non-query-able: "Is participating in any other type of eye related clinical or research study"